Clinical trial inclusion criterion:
All children scheduled for outpatient MRI scans with expected duration of scan between 30 minutes and 75 minutes.

Annotated entities:
- Qualifier: "outpatient"
- Procedure: "MRI scans"
- Measurement: "expected duration of scan"
- Value: "between 30 minutes and 75 minutes"